Clinical trial exclusion criterion:
7. History of alcohol abuse or use of any illicit drugs

Entity relations:
- OR("alcohol abuse", "use of illicit drugs")